Clinical trial exclusion criterion:
Hematopoietic cell transplantation within 4 weeks of first dose of 852A

Annotated entities:
- Procedure: "Hematopoietic cell transplantation"
- Temporal: "within 4 weeks of first dose"
- Drug: "852A"